Clinical trial exclusion criterion:
Patients with a baseline (pre-operative) opioid use greater than 30 mg of morphine equivalents/day.

Entity relations:
- Has_multiplier("opioid", "greater than 30 mg of morphine equivalents/day")
- Has_qualifier("opioid", "baseline")
- Subsumes("baseline", "pre-operative")